Clinical trial exclusion criterion:
Contraindications to MRI scanning including cardiac pacemaker, metallic objects and metallic implants contraindicating MRI, cardiac stent, claustrophobia;

Entity relations:
- AND("Contraindications", "MRI")
- Subsumes("Contraindications", "cardiac pacemaker")
- OR("cardiac pacemaker", "metallic objects", "metallic implants", "cardiac stent", "claustrophobia")